Clinical trial inclusion criteria:
Overweight/Obese Adult patients (age 19 years -65)
eligible based on WALI screening tool

Annotated entities:
- Condition: "Overweight"
- Condition: "Obese"
- Person: "Adult"
- Person: "age"
- Value: "19 years -65"
- Procedure: "WALI screening tool"
- Value: "eligible"